下列何者的分子內含有半縮酮（hemiketal）？
A. 環式 D-ribose
B. 環式 D-fructose
C. 環式 D-glucose
D. 6-phosphogluconolactone

正確答案：B. 環式 D-fructose